Clinical trial inclusion criterion:
INR = 1.5 x ULN unless subject has known hemophilia or is stable on an anticoagulant regimen affecting INR.

Entity relations:
- Has_value("INR", "= 1.5 x ULN")
- Has_negation("hemophilia", "unless")
- AND("INR", "hemophilia")
- OR("hemophilia", "stable on an anticoagulant regimen affecting INR")